Clinical trial inclusion criterion:
Person is >18 years old.

Entity relations:
- Has_value("old", ">18 years")